Clinical trial inclusion criterion:
Hgb =8.5 g/dL and =11.5 g/dL

Annotated entities:
- Measurement: "Hgb"
- Value: "=8.5 g/dL and =11.5 g/dL"